Clinical trial inclusion criteria:
Subjects scheduled for laparoscopic unilateral inguinal hernia repair
ASA 1 or2.
Age >18 years.

Annotated entities:
- Mood: "scheduled"
- Qualifier: "laparoscopic"
- Procedure: "inguinal hernia repair"
- Qualifier: "unilateral"
- Measurement: "ASA"
- Value: "1 or2"
- Person: "Age"
- Value: ">18 years"